Clinical trial exclusion criterion:
Unstable and advanced liver disease (as defined by the presence of at least one of the following: ascites, encephalopathy, coagulopathy, hypoalbuminemia, esophageal or gastric varices, or persistent jaundice)

Annotated entities:
- Qualifier: "Unstable"
- Qualifier: "advanced"
- Condition: "liver disease"
- Multiplier: "at least one"
- Condition: "ascites"
- Condition: "encephalopathy"
- Condition: "coagulopathy"
- Condition: "hypoalbuminemia"
- Condition: "esophageal varices"
- Condition: "gastric varices"
- Qualifier: "persistent"
- Condition: "jaundice"